Clinical trial exclusion criterion:
Mean arterial pressure less than 55 mmHg despite appropriate fluid resuscitation and vasopressor support.

Annotated entities:
- Measurement: "Mean arterial pressure"
- Value: "less than 55 mmHg"
- Procedure: "fluid resuscitation"
- Procedure: "vasopressor"